Known pancreatic, renal, hepatic, heart or thyroid diseased

The above is a clinical trial exclusion criterion. Annotated with entity spans:
Known [Condition: pancreatic], [Condition: renal], [Condition: hepatic], [Condition: heart] or [Condition: thyroid disease]d